Clinical trial inclusion criterion:
In self-reported menopause, defined as the permanent cessation of ovulation, for at least one year (Soules et al., 2001).

Entity relations:
- Has_qualifier("cessation of ovulation", "permanent")
- Has_temporal("menopause", "at least one year")
- Subsumes("menopause", "cessation of ovulation")